Signed Patient Informed Consent Form (ICF)

The above is a clinical trial inclusion criterion. Annotated with entity spans:
[Informed_consent: Signed Patient Informed Consent Form (ICF)]